Undergoing Assisted Reproductive Technique (ART) and oocyte maturation by human chorionic gonadotropin (HCG) triggering

The above is a clinical trial inclusion criterion. Annotated with entity spans:
[Temporal: Undergoing] [Procedure: Assisted Reproductive Technique (ART)] and [Procedure: oocyte maturation] by [Procedure: human chorionic gonadotropin (HCG) triggering]